對於骨質疏鬆症（Osteoporosis）之敘述，下列何者正確？
A. 骨質疏鬆症分為兩型，第一型主要為停經後造成之骨質疏鬆症，第二型則是因老化或鈣質吸收不足所造成，此二型發生之比例都以女性較男性高
B. 老化造成之骨質疏鬆症指 70 歲以上之病人，男比女約 2：1，主要造成脊椎壓迫性骨折（Compression fracture），髖部骨折（Hip fracture），近端橈骨骨折（Proximal radius fracture）
C. 目前世界衛生組織（WHO）定義 T-score 介於-1 及-2.5 即稱為骨質疏鬆症
D. 骨密度檢查（Bone mineral density），目前 SEXA（Single energy X-ray absorptiometry）比 DEXA

正確答案：A. 骨質疏鬆症分為兩型，第一型主要為停經後造成之骨質疏鬆症，第二型則是因老化或鈣質吸收不足所造成，此二型發生之比例都以女性較男性高